Clinical trial exclusion criterion:
Concomitant administration of strong inhibitors of P-glycoprotein like ketoconazole, cyclosporin, itraconazole or dronedarone

Entity relations:
- Subsumes("inhibitors of P-glycoprotein", "ketoconazole")
- OR("ketoconazole", "cyclosporin", "itraconazole", "dronedarone")